Clinical trial exclusion criterion:
Are undergoing an acute withdrawal syndrome from drugs or alcohol.

Annotated entities:
- Condition: "acute withdrawal syndrome"
- Drug: "drugs"
- Drug: "alcohol"